What is the nucleotide composition of the Lamin Associated Domains (LADs)?

Constitutive nuclear lamina-genome interactions are highly conserved and associated with A/T-rich sequence. Analysis of paralogs suggests that during evolution changes in A/T content have driven the relocation of genes to and from the nuclear lamina, in tight association with changes in expression level